Clinical trial inclusion criterion:
Progesterone (P4) serum level at the HCG triggering day <= 1.5 ng/mL (Day O/Randomization)

Entity relations:
- Has_index("at the HCG triggering day", "the HCG triggering day")
- Subsumes("the HCG triggering day", "Day O/Randomization")
- Has_value("at the HCG triggering day", "<= 1.5 ng/mL")
- Has_temporal("Progesterone (P4) serum level", "at the HCG triggering day")